有關成人之pheochromocytoma之敘述，下列何者錯誤？
A. 10%為兩側、10%為惡性、10%不⻑於腎上腺內（extra-adrenal）
B. 10%發生於multiple endocrine neoplasia（MEN）type II之病人
C. 診斷時測量尿液中之metanephrine或catecholamine比vanillylmandelic acid（VMA）更有效
D. NP-59核醫檢查用來定位pheochromocytoma腫瘤位置

正確答案：D. NP-59核醫檢查用來定位pheochromocytoma腫瘤位置